- Patient with IVF cycle and therefore having frozen-thawed embryos

The above is a clinical trial inclusion criterion. Annotated with entity spans:
- Patient with [Procedure: IVF cycle] and therefore having [Device: frozen-thawed embryos]